Clinical trial exclusion criterion:
Blood pressure greater than 140/90 and/or a pulse rate greater than 90 bpm

Entity relations:
- Has_value("pulse rate", "greater than 90 bpm")
- Has_value("Blood pressure", "greater than 140/90")